Realizamos la determinación de antígeno prostático específico (PSA) para diagnosticar carcinoma de próstata en adolescentes y en ancianos sanos, sin hiperplasia benigna de próstata:
1. La sensibilidad del PSA en los adolescentes será mayor que en los ancianos.
2. La especificidad del PSA en los adolescentes será menor que en los ancianos.
3. No cambiará la validez interna del PSA en adolescentes o ancianos sanos.
4. El valor predictivo positivo del PSA en los adolescentes será mayor que en los ancianos.

Respuesta correcta: 3. No cambiará la validez interna del PSA en adolescentes o ancianos sanos.